Subject has myxoma. Exclusion criteria based on laboratory abnormalities

The above is a clinical trial exclusion criterion. Annotated with entity spans:
Subject has [Condition: myxoma]. [Non-query-able: Exclusion criteria based on laboratory abnormalities]